Normotensive controls

The above is a clinical trial inclusion criterion. Annotated with entity spans:
[Qualifier: Normotensive] [Procedure: controls]